Which infection can be prevented with Dapivirine?

Vaginal ring containing Dapivirine is used for HIV prevention in women.